相較於瀰漫型硬皮症（diffuse systemic sclerosis），下列何者是侷限型硬皮症（limited systemic sclerosis）的特 性？
A. 皮膚硬化進展較快
B. 若併發間質性肺炎（interstitial lung disease）進展比較緩慢
C. 關節疼痛較嚴重
D. 常常出現anti-topoisomerase I（Scl-70）抗體陽性

正確答案：B. 若併發間質性肺炎（interstitial lung disease）進展比較緩慢